En el proceso de filtración, la velocidad de flujo es:
1. Directamente proporcional a la cantidad de la torta depositada.
2. Directamente proporcional a la cantidad de materiales en suspensión.
3. Dependiente del grado de ionización de la sustancia a filtrar.
4. Dependiente de la temperatura ambiental.
5. Inversamente proporcional a la cantidad de la torta depositada.

Respuesta correcta: 5. Inversamente proporcional a la cantidad de la torta depositada.